Clinical trial exclusion criterion:
Known hypersensitivity to vaginal progesterone or its excipients

Entity relations:
- AND("hypersensitivity", "vaginal progesterone")
- OR("vaginal progesterone", "excipients")